Clinical trial inclusion criterion:
adult female partner

Entity relations:
- multi("female partner", "female")